20 - 65 years old

The above is a clinical trial inclusion criterion. Annotated with entity spans:
[Value: 20 - 65 years] [Person: old]